Clinical trial exclusion criterion:
History of any malignancy or other severe diseases

Annotated entities:
- Condition: "malignancy"
- Condition: "severe diseases"